關於獨立樣本平均值的檢定，下列何者錯誤？
A. 兩個獨立樣本平均值的檢定可用t檢定
B. 三個以上獨立樣本平均值的檢定可用變異數分析
C. 樣本平均值的抽樣分布需要符合常態分布的假設
D. p值若小於顯	水準，代表接受虛無假說

正確答案：D. p值若小於顯	水準，代表接受虛無假說